Clinical trial exclusion criterion:
Mean pulmonary artery pressures =40mmHG and PVR >4 woods units as assessed by right heart catheterization.

Entity relations:
- Has_value("Mean pulmonary artery pressures", "=40mmHG")
- Has_value("PVR", ">4 woods units")
- AND("Mean pulmonary artery pressures", "right heart catheterization")
- AND("PVR", "right heart catheterization")